Person wears prosthesis daily and = 8 hours/day.

The above is a clinical trial inclusion criterion. Annotated with entity spans:
Person wears [Device: prosthesis] [Multiplier: daily and = 8 hours/day].